Clinical trial exclusion criterion:
Compromised ability of the patient to give written informed consent and/or to comply with study procedures

Entity relations:
- OR("give written informed consent", "comply with study procedures")